對於胃壁細胞（parietal cells）分泌胃酸的調節，下列配對何者正確？
A. 乙醯膽鹼（acetylcholine）－增加壁細胞內鈣離子濃度
B. 胃泌素（gastrin）－增加壁細胞內 cAMP 濃度
C. 組織胺（histamine）－增加壁細胞內鈣離子濃度
D. 體抑素（somatostatin）－增加壁細胞內 cAMP 濃度

正確答案：A. 乙醯膽鹼（acetylcholine）－增加壁細胞內鈣離子濃度